有一日本病患因持續嚴重肌肉痛而住院就診，問診知道發病前生吃熊肉後就開始腸胃不適，接著末梢血嗜伊紅性白血球非常顯著增加，同時伴隨發燒，臉部浮腫及肌痛，根據上述臨床症狀，該病患應最先考慮下列何種寄生蟲症？
A. 廣東住血線蟲症（angiostrongyliasis）
B. 無鈎囊蟲症（cysticercosis bovis）
C. 旋毛蟲症（trichinosis）
D. 班氏血絲蟲症（wuchereriasis）

正確答案：C. 旋毛蟲症（trichinosis）